Generalized pain or fibromyalgia;

The above is a clinical trial exclusion criterion. Annotated with entity spans:
[Condition: Generalized pain] or [Condition: fibromyalgia];